Clinical trial exclusion criterion:
History of severe head injury

Annotated entities:
- Condition: "severe head injury"
- Temporal: "History"